Central nervous system (CNS) infections or opportunistic conditions: brain abscess (bacterial, mycobacterial, fungal or Toxoplasma), meningitis with persistent neurologic impairment, primary CNS lymphoma, progressive multifocal leukoencephalopathy (PML), or another structural brain lesion with neurological sequelae

The above is a clinical trial exclusion criterion. Annotated with entity spans:
[Condition: Central nervous system (CNS) infections] or opportunistic conditions: [Condition: brain abscess] ([Qualifier: bacterial], [Qualifier: mycobacterial], [Qualifier: fungal] or [Qualifier: Toxoplasma]), [Condition: meningitis] with [Multiplier: persistent] [Condition: neurologic impairment], [Qualifier: primary] [Condition: CNS lymphoma], [Condition: progressive multifocal leukoencephalopathy (PML)], or [Qualifier: another] [Condition: structural brain lesion] with [Condition: neurological sequelae]